Known allergy/sensitivity or any hypersensitivity to components of study drugs or their formulation

The above is a clinical trial exclusion criterion. Annotated with entity spans:
Known [Condition: allergy]/[Condition: sensitivity] or any [Condition: hypersensitivity] to [Drug: components of study drugs] or their formulation